Clinical trial inclusion criterion:
Females of childbearing potential must agree to use an efficacious hormonal or barrier method of birth control during the study. Abstinence is acceptable.

Entity relations:
- Has_qualifier("birth control", "hormonal method")
- Has_qualifier("birth control", "efficacious")
- Has_temporal("birth control", "during the study")
- Has_mood("birth control", "agree to use")
- AND("Females", "birth control")
- AND("Females", "childbearing potential")
- OR("hormonal method", "barrier method")
- OR("birth control", "Abstinence")